戴先生最近覺得腹部間歇性腹痛，並有呼吸急促的現象，抽血檢查血色素為7 mg/dL，胃內視鏡檢查發現一潰瘍腫瘤且切片檢查證實為胃腸間質瘤（gastrointestinal stromal tumor，GIST）。下列敘述何者正確？
A. 手術切除範圍包括部分胃切除與局部淋巴清除
B. 胃腸間質瘤淋巴轉移的機率約20%
C. 術後化學治療可以提升存活率
D. 男性病患復發風險較女性病患高

正確答案：D. 男性病患復發風險較女性病患高